Qué aminoácido es precursor de neurotransmisiones como dopamina, adrenalina y noradrenalina?:
1. Triptófano.
2. Serina.
3. Tirosina.
4. Aspártico.
5. Glutámico.

Respuesta correcta: 3. Tirosina.